Clinical trial exclusion criterion:
Subject who, in the opinion of the investigator, will be noncompliant with the visit schedule or study procedures

Annotated entities:
- Non-representable: "in the opinion of the investigator"
- Informed_consent: "noncompliant with the visit schedule or study procedure"